當氣喘病人使用某噴霧製劑，可以使支氣管擴張，而此作用不受 β-blocker 之抑制，此外，本藥品一般無中樞神經之作用，口服時 bioavailability 少於 40%，則此藥品為何？
A. Atropine
B. Scopolamine
C. Glucocorticoid
D. Ipratropium

正確答案：D. Ipratropium